Clinical trial exclusion criterion:
Serum potassium >5.0 molar equivalent/L

Annotated entities:
- Measurement: "Serum potassium"
- Value: ">5.0 molar equivalent/L"